8. Is able to read, speak, and understand English.

The above is a clinical trial inclusion criterion. Annotated with entity spans:
[Parsing_Error: 8.] [Non-query-able: Is able to read, speak, and understand English.]